Clinical trial exclusion criterion:
Traumatic vascular injuries or operative interventions (Surgical harvesting) involving arteries of the upper limb on the operative side.

Annotated entities:
- Condition: "Traumatic vascular injuries"
- Procedure: "operative interventions"
- Procedure: "Surgical harvesting"
- Qualifier: "arteries of the upper limb on the operative side"